Clinical trial exclusion criterion:
Known hypersensitivity to LDV/SOF

Entity relations:
- AND("hypersensitivity", "LDV")
- OR("LDV", "SOF")